Clinical trial exclusion criterion:
Subjects who have been treated with clozapine or long-acting injectable antipsychotic drugs within 3 months prior to the screening.

Annotated entities:
- Drug: "clozapine"
- Drug: "long-acting injectable antipsychotic drugs"
- Temporal: "within 3 months prior to the screening"
- Reference_point: "the screening"